Clinical trial inclusion criterion:
1. Ages 50-95 years

Annotated entities:
- Person: "Ages"
- Value: "50-95 years"